supraventricular rhythm disorder

The above is a clinical trial exclusion criterion. Annotated with entity spans:
[Condition: supraventricular rhythm disorder]